Clinical trial inclusion criterion:
Completion of a 14-week open label trial of one the following SRI's: fluoxetine 80 mg/day, paroxetine 60 mg/day, fluvoxamine 300 mg/day, clomipramine 250 mg/day, sertraline 200 mg/day, citalopram 60 mg/day, escitalopram 30 mg/day and demonstrating a non or partial responses to SRI treatment (CGI-I of 3 or 4, Y-BOCS reduction of < 35%)

Annotated entities:
- Multiplier: "14-week"
- Drug: "fluoxetine"
- Multiplier: "80 mg/day"
- Drug: "paroxetine"
- Multiplier: "60 mg/day"
- Drug: "fluvoxamine"
- Multiplier: "300 mg/day"
- Drug: "clomipramine"
- Multiplier: "250 mg/day"
- Drug: "sertraline"
- Multiplier: "200 mg/day"
- Drug: "citalopram"
- Multiplier: "60 mg/day"
- Drug: "escitalopram"
- Multiplier: "30 mg/day"
- Condition: "responses to"
- Measurement: "CGI-I"
- Value: "3"
- Value: "4"
- Measurement: "Y-BOCS"
- Value: "reduction of < 35%"
- Multiplier: "one the following"
- Procedure: "SRI treatment"